¿Con qué nombre se conoce el trastorno que se caracteriza por la repetición constante y persistente de palabras, ideas, o temas, a los que el paciente recurre continuamente?:
1. Perseveración del pensamiento.
2. Pensamiento divagatorio.
3. Disgregación del pensamiento.
4. Circunstancialidad.
5. Inhibición del pensamiento.

Respuesta correcta: 1. Perseveración del pensamiento.